Clinical trial exclusion criterion:
Significant metabolic and endocrine diseases.

Entity relations:
- OR("metabolic diseases", "endocrine diseases")